Clinical trial exclusion criterion:
Has a history of an infected joint prosthesis, or has received antibiotics for a suspected infection of a joint prosthesis, if that prosthesis has not been removed or replaced

Annotated entities:
- Condition: "infected"
- Device: "joint prosthesis"
- Temporal: "history"
- Drug: "antibiotics"
- Mood: "suspected"
- Condition: "infection"
- Device: "joint prosthesis"